Clinical trial inclusion criterion:
Treated with conventional anti-depressant, administered within a formal psychiatric clinic or by a certified psychiatrist.

Entity relations:
- AND("Treated", "conventional anti-depressant")